Evidence of possible liver damage defined by an aspartate transaminase (AST) level that is more than 3x the upper limit of normal in an asymptomatic patient

The above is a clinical trial exclusion criterion. Annotated with entity spans:
Evidence of possible [Condition: liver damage] defined by an [Measurement: aspartate transaminase] ([Measurement: AST]) level that is [Value: more than 3x the upper limit of normal] in an asymptomatic patient